HCV genotype 4,

The above is a clinical trial inclusion criterion. Annotated with entity spans:
[Measurement: HCV genotype] [Value: 4],